Clinical trial exclusion criterion:
Use of hormone replacement therapy or hormonal contraceptive agents within days prior to surgery

Annotated entities:
- Procedure: "hormone replacement therapy"
- Drug: "hormonal contraceptive agents"
- Temporal: "within days prior to surgery"
- Reference_point: "surgery"